Clinical trial exclusion criterion:
Other significant medical illness that might interfere with this study: significant pulmonary dysfunction in the previous 6 months, malignancy other than skin basocellular carcinoma in previous 5 years, immunodeficiency syndromes (e.g. HIV positivity, auto-immune diseases, organ transplants other than cornea and hair transplant)

Annotated entities:
- Qualifier: "significant"
- Condition: "medical illness"
- Qualifier: "significant"
- Condition: "pulmonary dysfunction"
- Temporal: "in the previous 6 months"
- Condition: "malignancy"
- Negation: "other than"
- Condition: "skin basocellular carcinoma"
- Temporal: "in previous 5 years"
- Condition: "immunodeficiency syndromes"
- Condition: "HIV positivity"
- Condition: "auto-immune diseases"
- Procedure: "organ transplants"
- Negation: "other than"
- Procedure: "cornea transplant"
- Procedure: "hair transplant"